Clinical trial exclusion criterion:
history or evidence of administration of immunoglobulins and/or any blood products during the study period or within the three months preceding the study vaccine

Annotated entities:
- Procedure: "immunoglobulins"
- Procedure: "blood products"
- Temporal: "during the study period"
- Temporal: "within the three months preceding the study vaccine"
- Reference_point: "study period"
- Reference_point: "study vaccine"
- Grammar_Error: "and/or"